下列何者不屬於彈性動脈（elastic artery）？
A. 主動脈（aorta）
B. 頭臂動脈（brachiocephalic artery）
C. 肺動脈幹（pulmonary trunk）
D. 肱動脈（brachial artery）

正確答案：D. 肱動脈（brachial artery）